Patients with a personal situation judged by the investigator as unlikely to be compatible with optimal participation in the study, or which could constitute a risk for the patient.

The above is a clinical trial exclusion criterion. Annotated with entity spans:
Patients with a [Observation: personal situation] [Non-representable: judged by the investigator as unlikely to be compatible with optimal participation in the study], or which [Non-query-able: could constitute a risk for the patient].